下列那一種胜肽能吸收 280 nm波長的 光？
A. 丙胺酸-離胺酸-組織胺酸（Ala-Lys-His）
B. 丙胺酸-丙胺酸-色胺酸（Ala-Ala-Trp）
C. 絲胺酸-甘胺酸-天門冬醯胺（Ser-Gly-Asn）
D. 纈胺酸-脯胺酸-白胺酸（Val-Pro-Leu）

正確答案：B. 丙胺酸-丙胺酸-色胺酸（Ala-Ala-Trp）